Clinical trial inclusion criterion:
Willing to provide informed consent

Entity relations:
- Has_mood("informed consent", "Willing to provide")